Clinical trial inclusion criterion:
Women stimulated with Syntocinon® infusion for induction of labour (with or without cervical priming by prostaglandin)

Entity relations:
- multi("Syntocinon® infusion", "Syntocinon®")
- AND("induction of labour", "Syntocinon® infusion")
- AND("cervical priming", "prostaglandin")
- AND("Syntocinon® infusion", "cervical priming")